Clinical trial inclusion criterion:
Severely impaired hepatic function

Annotated entities:
- Condition: "impaired hepatic function"
- Qualifier: "Severely"